Clinical trial inclusion criterion:
At least 18 years of age at the time of screening

Annotated entities:
- Person: "age"
- Value: "At least 18 years"